Clinical trial exclusion criterion:
Any patient who, in the opinion of the Investigator, is not a good candidate for the study or will not be able to follow study procedures.

Annotated entities:
- Non-query-able: "Any patient who, in the opinion of the Investigator, is not a good candidate for the study or will not be able to follow study procedures"